Please list 2 treatments for a torn rotator cuff

Surgical repair earlier or later than 3 months after injury may result in similar outcomes and patient satisfaction.